Refuse to be enrolled

The above is a clinical trial exclusion criterion. Annotated with entity spans:
[Observation: Refuse to be enrolled]